傳統預防腦動脈瘤破裂出血後的腦血管痙攣（cerebral vasospasm）有所謂的"Triple-H" therapy，下列何者不包含於Triple-H？
A. hypervolemia
B. hypertension
C. hemodilution
D. hyperventilation

正確答案：D. hyperventilation